Clinical trial inclusion criterion:
Left ventricular ejection fraction <35%

Entity relations:
- Has_value("Left ventricular ejection fraction", "<35%")